Clinical trial inclusion criterion:
Subjects were to, in the opinion of the investigator, have no clinically significant abnormal findings of renal and hepatic function as determined by serum creatinine, total bilirubin, and transaminase levels.

Entity relations:
- AND("abnormal findings", "hepatic function")
- Subsumes("hepatic function", "serum creatinine")
- Has_qualifier("abnormal findings", "clinically significant")
- Has_negation("abnormal findings", "no")
- AND("abnormal findings", "renal function")
- AND("hepatic function", "renal function")
- AND("serum creatinine", "total bilirubin")
- AND("total bilirubin", "transaminase levels")